Clinical trial exclusion criterion:
Recent cerebrovascular accident

Entity relations:
- Has_temporal("cerebrovascular accident", "Recent")